Clinical trial exclusion criterion:
Inability to comply with study requirements.

Annotated entities:
- Post-eligibility: "Inability to comply with study requirements."